severe renal impairment

The above is a clinical trial exclusion criterion. Annotated with entity spans:
[Qualifier: severe] [Condition: renal impairment]